Chronic illness that, in the opinion of the investigator, is at a stage where it might interfere with trial conduct or completion

The above is a clinical trial exclusion criterion. Annotated with entity spans:
[Subjective_judgement: Chronic illness that, in the opinion of the investigator, is at a stage where it might interfere with trial conduct or completion]